NO es producida por la placenta la:
1. Hormona Luteinizante (LH).
2. Gonadotropina coriónica humana (HCG).
3. Progesterona.
4. Somatomamotrofína coriónica.

Respuesta correcta: 1. Hormona Luteinizante (LH).